嚴重頭部外傷病人，在發生典型的鉤回疝脫（uncal herniation）時的臨床表現為何？
A. 同側的瞳孔擴張與同側的肢體無力
B. 同側的瞳孔擴張與對側的肢體無力
C. 對側的瞳孔擴張與同側的肢體無力
D. 對側的瞳孔擴張與對側的肢體無力

正確答案：B. 同側的瞳孔擴張與對側的肢體無力